醫師值班接到一緊急轉診的病患：一位60歲婦女，因卵巢水瘤於診所接受手術，術中發現為一高度懷疑之右側卵巢惡性腫瘤，並已擴散至腹腔中，形成網膜硬塊（omentum cake），但是並無橫膈下或肝臟轉移。該診所未做任何切除手術，將傷口簡單關閉而立刻轉送本院。送至本院時，神智清醒，感覺傷口疼痛，生命徵象穩定，血壓138/86 mmHg，心搏86 bpm，傷口只有五針縫合，微滲血。接下來的處置，何者最適當？
A. 立刻送至開刀房行剖腹減積手術（debulking surgery）
B. 暫時給予化學治療1次，視病患情況，再行減積手術
C. 先行緊急電腦斷層檢查，評估腹內狀況，再行減積手術
D. 同步實施化學及放射線治療（concurrent chemoradiation），待腫瘤減小後再行減積手術

正確答案：A. 立刻送至開刀房行剖腹減積手術（debulking surgery）